What is the indication for Favipiravir?

Favipiravir (FVP) has been used for treatment of COVID-19 in many countries.